Clinical trial exclusion criterion:
non-genotype 4

Annotated entities:
- Condition: "genotype 4"
- Negation: "non"